La expresión simultánea de IgM e IgD como inmunoglobulinas de membrana ocurre en:
1. Células B que responden a antígenos timoindependientes.
2. Células B que responden a antígenos timodependientes.
3. Células B activadas estimuladas por la Interleucina 4 (IL-4).
4. Células B vírgenes inmaduras.
5. Células B vírgenes maduras.

Respuesta correcta: 5. Células B vírgenes maduras.